Which R/bioconductor package has been developed to aid in epigenomic analysis?

DeepBlueR